Clinical trial inclusion criterion:
have a history of childhood trauma.

Entity relations:
- Has_temporal("childhood trauma", "history")